Clinical trial inclusion criterion:
Patients aged 19 or older

Annotated entities:
- Person: "aged"
- Value: "19 or older"